List the main proteases used for sample digestion in proteomics.

Trypsin is the main protease used in proteomics followed by Asp-N, chymotrypsin, LysC, GluC and thermolysin.